Clinical trial exclusion criterion:
Inability to attend follow up visits

Entity relations:
- Has_context("Inability", "attend follow up visits")